Disponemos del registro de sujetos que se vacunan de la gripe en una región y campaña determinada, que incluye la información en el momento de la vacunación sobre antecedentes patológicos, edad, sexo y tipo de vacuna. Para los mismos sujetos disponemos también del registro con los diagnósticos de alta hospitalarios, ocurridos con posterioridad a la fecha de la vacunación, y existe un identificador personal común a ambos registros. Indique cuál de estos estudios sería posible realizar usando solo las citadas fuentes de información:
1. Un estudio analítico de cohorte para determinar si la vacunación aumenta el riesgo de desarrollar un síndrome de Guillain-Barré en las 16 primeras semanas tras la vacunación antigripal.
2. Un análisis descriptivo para estimar la incidencia de infarto agudo de miocardio en las primeras 16 semanas tras la vacunación antigripal.
3. Un análisis descriptivo para estimar la incidencia de fiebre en la primera semana posterior a la vacunación antigripal.
4. Un ensayo clínico que compare el riesgo de reacciones post-vacunales graves (que supongan ingreso hospitalario) con dos de los tipos de vacunas antigripales utilizados en esa campaña.
5. Un estudio de casos y controles para determinar si la vacunación aumenta el riesgo de desarrollar un infarto agudo de miocardio.

Respuesta correcta: 2. Un análisis descriptivo para estimar la incidencia de infarto agudo de miocardio en las primeras 16 semanas tras la vacunación antigripal.